下列何者最不可能出現在毛毛樣血管疾病（moyamoya disease）？
A. 雙側顱內內頸動脈狹窄
B. 腦部出現煙霧狀血管
C. 顱內血管母細胞瘤（hemangioblastoma）
D. 顱內動脈瘤

正確答案：C. 顱內血管母細胞瘤（hemangioblastoma）